一位55歲女性病人，過去無腎臟病史，因最近一週尿量漸減且體重增加而住院。身體診察：血壓180/110 mmHg，脈搏72/min，呼吸次數16/min，呼吸音正常，心律規則無雜音，腹部平坦無壓痛，下肢有顯	壓陷性水腫。血液檢查：血紅素10 gm/dL，白血球10500 /µL，白蛋白2.5 g/dL，尿素氮35 mg/dL，肌酸酐3.0 mg/dL；尿液檢查：蛋白質（3+），紅血球20 ～25顆/高倍視野，並可見到紅血球圓柱體。本病人接受腎臟切片檢查後，最適當治療方式為？
A. 廣效性抗生素（broad-spectrum antibiotics）
B. 免疫抑制劑（immunosuppressive therapy）
C. 緊急血液透析（emergent hemodialysis）
D. 補充白蛋白（albumin infusion）

正確答案：B. 免疫抑制劑（immunosuppressive therapy）